Pregnancy or unwilling to adopt reliable contraceptive measures during the month after drug application;

The above is a clinical trial exclusion criterion. Annotated with entity spans:
[Pregnancy_considerations: Pregnancy or unwilling to adopt reliable contraceptive measures during the month after drug application];